Clinical trial exclusion criterion:
Any cardiac surgery within the past 60 days (2 months) or valvular cardiac surgical procedure at any time (i.e., ventriculotomy, atriotomy, and valve repair or replacement and presence of a prosthetic valve)

Entity relations:
- Subsumes("valvular cardiac surgical", "ventriculotomy")
- Subsumes("within the past 60 days", "2 months")
- Has_temporal("cardiac surgery", "within the past 60 days")
- OR("ventriculotomy", "atriotomy", "valve replacement", "valve repair", "prosthetic valve)")
- OR("cardiac surgery", "valvular cardiac surgical")